Clinical trial exclusion criterion:
Have a diagnosis of schizophrenia or other major psychiatric diagnosis or mental illness (e.g. major depression)

Annotated entities:
- Condition: "schizophrenia"
- Condition: "major psychiatric diagnosis"
- Condition: "mental illness"
- Condition: "major depression"